Clinical trial exclusion criterion:
Cardiovascular or pulmonary disease

Annotated entities:
- Condition: "Cardiovascular disease"
- Condition: "pulmonary disease"